Excess alcohol intake (males: = 28 units/week, females: = 21 units/week. One unit of alcohol = 8 oz beer, 1 oz hard liquor or 4 oz wine).

The above is a clinical trial exclusion criterion. Annotated with entity spans:
[Value: Excess] [Measurement: alcohol intake] ([Person: males]: [Value: = 28 units/week], [Person: females]: [Value: = 21 units/week]. [Non-representable: One unit of alcohol = 8 oz beer, 1 oz hard liquor or 4 oz wine]).